Durante la contracción de una fibra muscular esquelética se acortan:
1. Los filamentos de actina.
2. Los filamentos de miosina.
3. Los sarcómeros.
4. Los túbulos T (túbulos transversos).

Respuesta correcta: 3. Los sarcómeros.